Participant has a history of spontaneous, prolonged or severe bleeding of unclear origin

The above is a clinical trial exclusion criterion. Annotated with entity spans:
Participant has a [Temporal: history] of [Qualifier: spontaneous], [Qualifier: prolonged] or [Qualifier: severe] [Condition: bleeding] of [Qualifier: unclear origin]